Clinical trial exclusion criterion:
Comorbidities such as uncontrolled cardiovascular disease, i.e., unstable systemic arterial hypertension, coronary artery disease; previous stroke; OSA; pneumothorax in the last 2 months.

Annotated entities:
- Condition: "cardiovascular disease"
- Qualifier: "uncontrolled"
- Condition: "Comorbidities"
- Qualifier: "unstable"
- Condition: "systemic arterial hypertension"
- Condition: "coronary artery disease"
- Temporal: "previous"
- Condition: "stroke"
- Condition: "OSA"
- Condition: "pneumothorax"
- Temporal: "in the last 2 months"